6. Home environment safe and amenable to rest , availability of family support such as a sister or mother who will help the patient at home .

The above is a clinical trial inclusion criterion. Annotated with entity spans:
[Parsing_Error: 6.] [Non-query-able: Home environment safe and amenable to rest , availability of family support such as a sister or mother who will help the patient at home .]